Clinical trial inclusion criterion:
FEV1 < 40% of predicted value, FEV1/FVC < 70%

Annotated entities:
- Measurement: "FEV1"
- Value: "< 40% of predicted value"
- Measurement: "FEV1/FVC"
- Value: "< 70%"